Clinical trial exclusion criterion:
Sufficiently socially unstable as to preclude participation (e.g. homeless)

Entity relations:
- Has_qualifier("socially unstable", "Sufficiently")